How can B-cells transdifferentiate into macrophages?

C/EBPβ-expressing B cells produced granulocyte-macrophage progenitor (GMP)-like progenitors when subjected to selective pressure to eliminate lymphoid cells. Tet2 helps CEBPα rapidly derepress myeloid genes during the conversion of pre-B cells into macrophages.